下列有關低劑量 aspirin 之防治心肌梗塞之理由，何者錯誤？
A. Aspirin 作用在血小板 cycloxygenase（COX）是不可逆性
B. 主要抑制血小板中thromboxane A2之形成
C. 高劑量下會抑制內皮細胞之 COX，同時 prostacyclin 形成會減少
D. 內皮細胞中 COX 受抑制，不會有再生之作用

正確答案：D. 內皮細胞中 COX 受抑制，不會有再生之作用